Admission from an other ICU where the patient remained for more than 24 hours

The above is a clinical trial exclusion criterion. Annotated with entity spans:
[Procedure: Admission] from [Visit: an other ICU] where the [Observation: patient remained] [Multiplier: for more than 24 hours]